Clinical trial inclusion criterion:
Elective surgery for thoracic aneurysm

Annotated entities:
- Procedure: "Elective surgery"
- Condition: "thoracic aneurysm"